Clinical trial exclusion criterion:
Household or other close/intimate contact(s) under the age of 12 months.

Entity relations:
- Has_value("age", "under 12 months")
- OR("Household", "close/intimate contact(s)")